Clinical trial exclusion criterion:
Patients with a history of type I or type II diabetes or HbA1c greater than 6.5%.

Entity relations:
- Has_value("HbA1c", "greater than 6.5%")
- Has_temporal("type I diabetes", "history")
- OR("type I diabetes", "HbA1c", "type II diabetes")